What disease does BCG immunotherapy used to treat?

Bacillus Calmette- Guérin (BCG) immunotherapy is used for treatment of bladder cancer.